Clinical trial inclusion criterion:
HbA1c :>6.5%

Entity relations:
- Has_value("HbA1c", ">6.5%")